Clinical trial exclusion criterion:
Fasting glucose = 126 mg/dL on 2 occasions during screening indicating need for prompt treatment;

Entity relations:
- Has_value("Fasting glucose", "= 126 mg/dL")
- Has_multiplier("Fasting glucose", "2 o")